下列何者並非金黃色葡萄球菌（Staphylococcus aureus）常見的致病因子（virulence factor）？
A. 凝固酶（coagulase）
B. 毒性休克症候毒素-1（toxic shock syndrome toxin-1）
C. 水腫因子（edema factor）
D. 蛋白質A（protein A）

正確答案：C. 水腫因子（edema factor）